Clinical trial inclusion criterion:
No narcotic before surgery as premedication

Annotated entities:
- Negation: "No"
- Drug: "narcotic"
- Temporal: "before surgery"
- Reference_point: "surgery"
- Procedure: "surgery"